Clinical trial exclusion criterion:
Craniofacial or cardiothoracic malformations

Entity relations:
- OR("Craniofacial malformations", "cardiothoracic malformations")